有關 Vincent 氏咽峽炎（Vincent's angina）的敘述，下列何者錯誤？
A. 與口腔或牙齒之衛生習慣不佳有關
B. 扁桃腺上可見潰瘍或膜性分泌物覆蓋
C. 屬於腺病毒（adenovirus）感染，無需使用抗生素
D. 具有高度傳染性

正確答案：C. 屬於腺病毒（adenovirus）感染，無需使用抗生素